下列何種人體寄生蟲可以藉由母親哺乳途徑傳染給嬰兒？
A. 東方毛線蟲（Trichostrongylus orientalis）
B. 肝毛線蟲（Capillaria hepatica）
C. 糞小桿線蟲（Strongyloides stercoralis）
D. 旋毛蟲（Trichinella spiralis）

正確答案：C. 糞小桿線蟲（Strongyloides stercoralis）